Known liver failure (bilirubin >1.Sx upper limit of normal)

The above is a clinical trial exclusion criterion. Annotated with entity spans:
Known [Condition: liver failure] ([Measurement: bilirubin] [Value: >1.Sx upper limit of normal])